Clinical trial exclusion criterion:
History of violence within 6 months prior to study entry

Entity relations:
- Has_temporal("violence", "within 6 months prior")
- Has_context("History", "violence")